Clinical trial exclusion criterion:
History of alcoholism, drug abuse, psychiatric, psychological or other emotional problems that are likely to invalidate informed consent

Annotated entities:
- Condition: "alcoholism"
- Condition: "drug abuse"
- Condition: "psychiatric problems"
- Condition: "psychological problems"
- Condition: "emotional problems"